有關angiotensin-converting enzyme inhibitors的腎臟保護作用，下列何者錯誤？
A. 可以降低血壓
B. 可以降低蛋白尿
C. 可以增加腎絲球過濾速率
D. 可以降低出球小動脈的壓力

正確答案：C. 可以增加腎絲球過濾速率